一30歲男子因流鼻血4週求診。理學檢查顯示左邊submanibular angle有一firm、non-tender and fixed mass，該腫塊沒有局部感染之徵候，在這個階段最適當的檢查為何？
A. 淋巴結超音波
B. 切除生檢（excisional biopsy）
C. 細針穿刺（fine needle aspiration）
D. fiberoscopic檢查和鼻咽部的生檢

正確答案：D. fiberoscopic檢查和鼻咽部的生檢